Clinical trial exclusion criterion:
History of clinically significant disease, including any cardiovascular, hepatic, renal, respiratory, hematologic, endocrinologic, or neurologic disease, or clinically significant laboratory abnormality that is not stabilized or is anticipated to require treatment during the study.

Annotated entities:
- Qualifier: "clinically significant"
- Condition: "disease"
- Condition: "cardiovascular disease"
- Condition: "endocrinologic disease"
- Condition: "hematologic disease"
- Condition: "respiratory disease"
- Condition: "renal disease"
- Condition: "hepatic disease"
- Condition: "neurologic disease"
- Qualifier: "clinically significant"
- Condition: "laboratory abnormality"
- Negation: "not"
- Qualifier: "stabilized"
- Mood: "anticipated to require"
- Procedure: "treatment"
- Temporal: "during the study"